有關 E 型肝炎病毒的敘述，下列何者正確？
A. 可造成慢性肝炎甚至肝癌
B. 可以 RT-PCR 進行偵測
C. 感染孕婦有較低的致死率
D. 病毒基因體只含有一個大的 open reading frame（ORF）

正確答案：B. 可以 RT-PCR 進行偵測